Clinical trial exclusion criterion:
Current renal (creatinine>2x upper limit of normal (ULN), dialysis, kidney transplant) or hepatic dysfunction (AST/ALT>2x ULN, liver transplant or neoplasm)

Annotated entities:
- Measurement: "creatinine"
- Value: ">2x upper limit of normal (ULN)"
- Procedure: "dialysis"
- Procedure: "kidney transplant"
- Condition: "renal dysfunction"
- Condition: "hepatic dysfunction"
- Measurement: "AST"
- Measurement: "ALT"
- Value: ">2x ULN"
- Procedure: "liver transplant"
- Condition: "neoplasm"